Clinical trial exclusion criterion:
long-term use of analgesics,sedatives or non steroidal anti-inflammatory drugs history.

Annotated entities:
- Multiplier: "long-term use"
- Drug: "analgesics"
- Drug: "sedatives"
- Drug: "non steroidal anti-inflammatory drugs"
- Temporal: "history"